Clinical trial exclusion criterion:
Women pregnant or lactating, or women planning to become pregnant

Entity relations:
- Has_mood("pregnant", "planning to become")
- OR("pregnant", "lactating", "pregnant")